Clinical trial exclusion criterion:
Prisoners.

Annotated entities:
- Person: "Prisoners"